Clinical trial exclusion criterion:
Epiretinal membrane and/or vitreomacular traction in the study eye as determined by the central reading center.

Entity relations:
- Has_qualifier("Epiretinal membrane traction", "in the study eye")
- OR("Epiretinal membrane traction", "vitreomacular traction")